History of diseases with influence on bone metabolism such as Paget's disease and primary hyperparathyroidism

The above is a clinical trial exclusion criterion. Annotated with entity spans:
[Temporal: History] of [Condition: diseases with influence on bone metabolism] such as [Condition: Paget's disease] and [Condition: primary hyperparathyroidism]